Clinical trial exclusion criterion:
Pelvic inflammatory disease.

Annotated entities:
- Condition: "Pelvic inflammatory disease"